病人在門診自訴吞嚥困難已有一年之久，且常伴隨中段胸骨後方有東西卡住的感覺。吞嚥困難僅限於固態食物，喝流質東西則沒有困難。但並非每餐都會出現，時好時壞。病人也沒有 體重減輕之現象。身體診察沒有異常發現。關於這位病人之診斷，下列各項敘述，何者正確？
A. 本病人之診斷，很可能是achalasia
B. 本病人之致病機轉可能在於食道蠕動異常
C. 鋇劑攝影（barium meal study）對本病人之診斷很有效益
D. 此等病人雖非食道癌，其治療仍以手術為主

正確答案：C. 鋇劑攝影（barium meal study）對本病人之診斷很有效益